下列那一項不是世界衛生組織頒布的渥太華健康促進宣言所強調的策略？
A. 建立支持性的環境
B. 推動社區健康行動
C. 擬定健康政策
D. 重視醫療技能

正確答案：D. 重視醫療技能